Señale la respuesta INCORRECTA con respecto a la infección por virus de la inmunodeficiencia humana (VIH) y gestación:
1. La cesárea programada no reduce la tasa de transmisión vertical del virus.
2. Se ofrecerá a la gestante la posibilidad de realizar tratamiento antirretroviral sea cual sea su estadio de la enfermedad, con la finalidad de prevenir la transmisión vertical del virus.
3. La transmisión vertical del virus se asocia a la carga viral materna.
4. Se tiene que ofrecer a toda gestante la serología VIH en la primera consulta, sea cual sea el momento del embarazo.
5. Las mujeres infectadas por el VIH tienen un mayor riesgo de presentar abortos espontáneos, muerte fetal intraútero y retraso del crecimiento intrauterino.

Respuesta correcta: 1. La cesárea programada no reduce la tasa de transmisión vertical del virus.